長期 Crohn's 疾病可能導致小腸及大腸惡性病變，以何種惡性腫瘤居多？
A. 類癌（carcinoid）
B. 淋巴癌（lymphoma）
C. 腺癌（adenocarcinoma）
D. 組織間質癌（stromal tumor）

正確答案：C. 腺癌（adenocarcinoma）